the surgery is laparoscopic surgery and is expected to last for = 2 hours under general anesthesia and the patient will stay in hospital for at least 7 days after surgery.

The above is a clinical trial inclusion criterion. Annotated with entity spans:
the surgery is [Procedure: laparoscopic surgery] and is [Mood: expected] to [Measurement: last] for [Value: = 2 hour]s [Qualifier: under general anesthesia] and the patient [Mood: will] [Procedure: stay in hospital] for [Value: at least 7 days after surgery].